Surgery to the treated limb less than 6 months previously.

The above is a clinical trial exclusion criterion. Annotated with entity spans:
[Procedure: Surgery] to the [Qualifier: treated limb] [Temporal: less than 6 months] previously.